1. Subject has a history of GTC seizures, either primary GTC or partial onset seizures with secondary generalization.

The above is a clinical trial inclusion criterion. Annotated with entity spans:
[Parsing_Error: 1.] Subject has a [Temporal: history] of [Condition: GTC seizures], either [Condition: primary GTC] or [Condition: partial onset seizures] with [Condition: secondary generalization].